What class of drugs have been given a black box warning for suicide?

The U.S Food and Drug Administration issued a Black box warning in October 2004 after placebo-controlled trials of antidepressant medications found an increased risk of suicidal thoughts and behaviors among children and adolescents taking antidepressant medications relative to placebo.